Clinical trial inclusion criterion:
International Classification for Surgery of the Hand in Tetraplegia of 0-5 at 6 months

Annotated entities:
- Measurement: "International Classification for Surgery of the Hand in Tetraplegia"
- Value: "0-5"
- Temporal: "at 6 months"